Clinical trial exclusion criterion:
6. Presence of abnormal physical finding on the vulva, vaginal walls or cervix during pelvic/speculum examination and/or colposcopy

Annotated entities:
- Condition: "abnormal physical finding on the vulva"
- Condition: "abnormal physical finding on the vaginal walls"
- Condition: "abnormal physical finding on the cervix"
- Procedure: "speculum examination"
- Procedure: "pelvic examination"
- Procedure: "colposcopy"